Clinical trial exclusion criterion:
8. Currently enrolled in an investigational drug or device study or have used an investigational drug or device within 30 days prior to Visit 1.

Annotated entities:
- Parsing_Error: "8."
- Drug: "investigational drug"
- Context_Error: "investigational drug"
- Device: "investigational device"
- Context_Error: "investigational device"
- Drug: "investigational drug"
- Context_Error: "investigational drug"
- Temporal: "within 30 days prior to Visit 1"
- Reference_point: "Visit 1"
- Device: "investigational device"